Clinical trial inclusion criterion:
with at least 1 sound and fully erupted permanent first molar

Entity relations:
- Has_qualifier("permanent first molar", "fully erupted")
- Has_qualifier("permanent first molar", "sound")
- Has_multiplier("permanent first molar", "at least 1")